¿Cuál de los siguientes nutrientes requiere una atención y recomendación más especial en la edad avanzada?
1. Selenio.
2. Calcio.
3. Aminoácidos esenciales.
4. Lípidos.
5. Fibra.

Respuesta correcta: 2. Calcio.